Clinical trial exclusion criteria:
General danger signs or symptoms of severe malaria
Anaemia, defined as Hb <9g/dl
G6PD deficiency (as determined by FST)
Pregnant women as determined by Urine ß-HCG pregnancy test
Known hypersensitivity to any of the drugs given

Annotated entities:
- Condition: "malaria"
- Qualifier: "severe"
- Condition: "Anaemia"
- Measurement: "Hb"
- Value: "<9g/dl"
- Condition: "G6PD deficiency"
- Pregnancy_considerations: "Pregnant women as determined by Urine ß-HCG pregnancy test"
- Condition: "hypersensitivity"
- Drug: "drugs"